Clinical trial exclusion criterion:
usual place of residence outside Seine-Saint-Denis

Entity relations:
- Has_qualifier("place of residence", "outside Seine-Saint-Denis")